Corresponde a una mutación génica por transversión:
1. T→C.
2. A→T.
3. G→A.
4. C→T.
5. A→G.

Respuesta correcta: 2. A→T.